Allergy or hypersensitivity to bupivacaine

The above is a clinical trial exclusion criterion. Annotated with entity spans:
[Condition: Allergy] or [Condition: hypersensitivity] to [Drug: bupivacaine]